Suffer from schizophrenia/schizoaffective disorder meeting Diagnostic and Statistical Manual of Mental Disorders, Fourth Edition, Text Revision (DSM-IV-TR) criteria;

The above is a clinical trial inclusion criterion. Annotated with entity spans:
Suffer from [Condition: schizophrenia]/[Condition: schizoaffective disorder] meeting [Measurement: Diagnostic and Statistical Manual of Mental Disorders, Fourth Edition, Text Revision] ([Measurement: DSM-IV-TR]) criteria;